List four principles of medical ethics.

The four principles of medical ethics proposed by Beauchamp and Childress are autonomy, non-maleficence, beneficence and justice. They have been extremely influential in the field of medical ethics, and are fundamental for understanding the current approach to ethical assessment in health care.